18-80 years

The above is a clinical trial inclusion criterion. Annotated with entity spans:
[Value: 18-80] [Person: years]